Clinical trial exclusion criterion:
ASA physical state >II

Annotated entities:
- Measurement: "ASA physical state"
- Value: ">II"